2. history of congestive heart failure, unstable cardiac arrhythmias, hypertrophic cardiomyopathy, severe aortic stenosis, angina or dyspnea at rest or during ADL's;

The above is a clinical trial exclusion criterion. Annotated with entity spans:
[Parsing_Error: 2.] [Temporal: history] of [Condition: congestive heart failure], [Condition: unstable cardiac arrhythmias], [Condition: hypertrophic cardiomyopathy], [Condition: severe aortic stenosis], [Condition: angina] or [Condition: dyspnea at rest] or during ADL's;